有關巴氏量表（Barthel Index）與功能獨立評量（Functional Independence Measure）兩者之內容比較，下列敘述何者錯誤？
A. 兩者都是分數越高表示功能越獨立
B. 功能獨立評量包含了溝通能力及社會認知的評量
C. 巴氏量表單項評分最高分是 7 分
D. 功能獨立評量單項在 5 分（含）以下表示該功能需要協助

正確答案：C. 巴氏量表單項評分最高分是 7 分